What is formative pluripotency?

Formative pluripotency is an intermediate state of differentiation that we call "formative". It is proposed to exist as part of a developmental continuum between the naïve and primed phases. It consists of a gene regulatory network switch from the naïve state to the formative epiblast-like cells of EpiLCs.